2. Screening tool: TMS safety screening questionnaire.

The above is a clinical trial exclusion criterion. Annotated with entity spans:
[Parsing_Error: 2.] [Not_a_criteria: Screening tool: TMS safety screening questionnaire.]